What is the oldest human sample analysed by paleontology proteomics?

The Tyrolean Iceman's brain is the oldest (5300 years old) human sample that has been studied by paleoproteomics.